Clinical trial inclusion criterion:
1. Ages 50-95 years

Entity relations:
- Has_value("Ages", "50-95 years")